Clinical trial inclusion criteria:
Patients diagnosed with primary biliary cholangitis
Treated with Ursodeoxycholic Acid in West China Hospital for at least 6 month and suboptimal response to Ursodeoxycholic Acid

Annotated entities:
- Condition: "primary biliary cholangitis"
- Drug: "Ursodeoxycholic Acid"
- Visit: "West China Hospital"
- Temporal: "for at least 6 month"
- Condition: "suboptimal response"
- Drug: "Ursodeoxycholic Acid"